關於主動脈內氣球幫浦（intra-aortic balloon pump）之敘述，下列何者錯誤？
A. 增加動脈收縮壓（systolic blood pressure）
B. 增加動脈舒張壓（diastolic blood pressure）
C. 增加冠狀動脈血流量
D. 增加心搏輸出量

正確答案：A. 增加動脈收縮壓（systolic blood pressure）